Clinical trial inclusion criterion:
Chest x-ray, computerized tomography (CT) scan, or chest magnetic resonance imaging (MRI) with evidence of ongoing infectious or malignant process, obtained within 3 months prior to screening and evaluated by a qualified physician.

Annotated entities:
- Procedure: "Chest x-ray"
- Procedure: "computerized tomography (CT) scan"
- Procedure: "chest magnetic resonance imaging (MRI)"
- Temporal: "ongoing"
- Condition: "infectious"
- Condition: "malignant process"
- Temporal: "within 3 months prior to screening"